下列藥理作用何者與 misoprostol 之療效無關？
A. 減少胃酸分泌
B. 促進胃黏液分泌
C. 促進子宮收縮
D. 血管收縮

正確答案：D. 血管收縮